有關非密螺旋體（nontreponemal）及密螺旋體（treponemal）梅毒血清學試	結果的判讀，下列敘述何者錯誤？
A. 有些紅斑性狼瘡（SLE）患者會出現長期非密螺旋體試	偽陽性反應
B. 愛滋病（AIDS）患者以密螺旋體試	為陰性反應時，仍無法排除感染梅毒螺旋體（Treponema pallidum）  	的可能性
C. 患者的生殖器出現潰瘍時，若非密螺旋體試	結果為陰性，則可排除梅毒螺旋體感染的可能
D. 監測治療梅毒過程，密螺旋體試	相對於非密螺旋體試	較不易受到治療的影響

正確答案：C. 患者的生殖器出現潰瘍時，若非密螺旋體試	結果為陰性，則可排除梅毒螺旋體感染的可能